Clinical trial exclusion criterion:
Colonoscopy scheduled to be undertaken peroperatively

Entity relations:
- Has_temporal("undertaken", "peroperatively")
- Has_mood("undertaken", "scheduled")
- AND("Colonoscopy", "undertaken")